Clinical trial inclusion criterion:
Able to sign the consent form of anticipating in the study

Annotated entities:
- Informed_consent: "Able to sign the consent form of anticipating in the study"